Expected survival = 3 months

The above is a clinical trial inclusion criterion. Annotated with entity spans:
[Observation: Expected survival] [Value: = 3 months]